施行人工輔助生殖技術（ART）時，發生黃體功能不足（Luteal phase defect）的原因不包含：
A. 排卵期間無法產生足夠的促性腺激素和黃體素
B. 取卵手術時，破壞卵巢顆粒細胞
C. 使用陰道黃體素治療取代肌肉注射
D. 使用的藥物抑制內生性黃體生成激素（LH）的生成

正確答案：C. 使用陰道黃體素治療取代肌肉注射